Clinical trial inclusion criterion:
International Classification for Surgery of the Hand in Tetraplegia of 0-5 at 6 months

Entity relations:
- Has_value("International Classification for Surgery of the Hand in Tetraplegia", "0-5")
- Has_temporal("International Classification for Surgery of the Hand in Tetraplegia", "at 6 months")